Clinical trial inclusion criterion:
Age between 20 and 40

Annotated entities:
- Person: "Age"
- Value: "between 20 and 40"